Clinical trial exclusion criterion:
Live donor transplantation scheduled within 6 months

Entity relations:
- Has_mood("Live donor transplantation", "scheduled")
- Has_temporal("Live donor transplantation", "within 6 months")